Clinical trial exclusion criterion:
Myopia > 6D;

Entity relations:
- Has_value("Myopia", "> 6D")